Clinical trial inclusion criterion:
women in the reproductive period must be completely contraception in 28 days before treatment, during the treatment process and in 28 days after treatment;

Entity relations:
- Has_index("in 28 days before treatment", "treatment")
- Has_index("during the treatment process", "treatment")
- Has_index("in 28 days after treatment", "treatment")
- Has_temporal("contraception", "during the treatment process")